Uterine abnormalities.

The above is a clinical trial exclusion criterion. Annotated with entity spans:
[Condition: Uterine abnormalities].